Clinical trial exclusion criteria:
Active consumption of alcohol and/or drugs
Co-infection with human immunodeficiency virus, hepatitis C virus, or hepatitis D virus
History of autoimmune hepatitis
Psychiatric disease
Evidence of neoplastic diseases of the liver

Annotated entities:
- Condition: "consumption of alcohol"
- Condition: "drugs consumption of"
- Qualifier: "Active"
- Condition: "human immunodeficiency virus"
- Condition: "hepatitis C virus"
- Condition: "hepatitis D virus"
- Condition: "autoimmune hepatitis"
- Condition: "Psychiatric disease"
- Condition: "neoplastic diseases"
- Qualifier: "liver"